En el proceso          de    la   defecación   es VERDADERO:
1. Cuando las heces penetran en la ampolla rectal se produce una relajación del esfínter anal interno de forma consciente.
2. Cuando las heces penetran en la ampolla rectal se produce una relajación del esfínter anal externo de forma inconsciente.
3. El esfínter anal externo lo controlan fibras nerviosas del nervio pudendo, parte del sistema nervioso somático, y por tanto bajo control consciente voluntario.
4. Los movimientos propulsivos del colon en condiciones normales necesitan una hora para desplazar el quimo a través de todo el colon desde la válvula ileocal.
5. Durante la defecación se produce la contracción del suelo de la pelvis.

Respuesta correcta: 3. El esfínter anal externo lo controlan fibras nerviosas del nervio pudendo, parte del sistema nervioso somático, y por tanto bajo control consciente voluntario.